Ejection fraction = 50%, no severe arrhythmia.

The above is a clinical trial inclusion criterion. Annotated with entity spans:
[Measurement: Ejection fraction] [Value: = 50%], [Negation: no] [Qualifier: severe] [Condition: arrhythmia].